下列何種病變與血管炎症候群（vasculitis syndrome）的發生有關？
A. B 淋巴球在血管壁形成肉芽腫（granuloma）所致
B. 類澱粉（amyloid）在血管壁的沈積所致
C. 免疫複合物在血管壁的沈積所致
D. 蛋白質 C（protein C）的缺乏所致

正確答案：C. 免疫複合物在血管壁的沈積所致